Clinical trial inclusion criteria:
Patients with STEMI undergoing primary PPCI
Age > 18 years old

Annotated entities:
- Condition: "STEMI"
- Procedure: "primary PPCI"
- Person: "Age"
- Value: "> 18 years old"